Clinical trial exclusion criterion:
Evidence of clinically significant cardiac abnormalities, uncontrolled hypotension, left ventricular ejection fraction below the lower limit of normal for the site or experience of significant cardiac interventional procedures

Entity relations:
- Has_value("left ventricular ejection fraction", "below the lower limit of normal")
- Has_qualifier("cardiac interventional procedures", "significant")
- Has_qualifier("cardiac abnormalities", "clinically significant")
- OR("cardiac abnormalities", "uncontrolled hypotension", "left ventricular ejection fraction", "cardiac interventional procedures")